How are super enhancers defined?

Super-enhancers are defined as genomic regions spanned by highly conserved non-coding elements (HCNEs), which include enhancers, transcription factor binding sites that can activate or repress gene expression by multiple mechanisms.